Which is the target of belimumab in Systemic Lupus Erythematosus treatment?

Belimumab is a fully human anti-BLyS monoclonal antibody with specificity for BLyS. It is approved for SLE treatment.